El bortezomib es un inhibidor del proteasoma aprobado para tratar el mieloma múltiple. ¿Qué tipo de grupo ácido está presente en su estructura y es necesario para su actividad?:
1. Borónico.
2. Fosfónico.
3. Sulfínico.
4. Carbámico.
5. Carboxílico.

Respuesta correcta: 1. Borónico.